下列何種惡性病最可能以化學治療藥物（chemotherapy）治癒？
A. non-smal cell lung carcinoma
B. colorectal carcinoma
C. seminoma
D. chronic myeloid leukemia

正確答案：C. seminoma